Clinical trial inclusion criterion:
Patients undergoing elective abdominal surgery with an expected blood loss of = 500 ml

Entity relations:
- Has_value("expected blood loss", "= 500 ml")
- Has_qualifier("abdominal surgery", "elective")
- AND("abdominal surgery", "expected blood loss")